一位67歲的女性，無特別病史、發燒或營養不良狀況。主訴一個月來有持續性背痛，X光顯示在第七、十、十一胸椎壓迫性骨折，椎莖（pedicle）及椎間盤完整。血液檢	顯示 Albumin: 2.5 gm/dL ; Total protein: 10.1 gm/dL ; Ca（calcium）: 11.0 mg/dL。針對血液檢及X光結果，最有可能的診斷為何？
A. 脊椎細菌感染（infectious spondylitis）
B. 惡性腫瘤轉移（malignant tumor metastases）
C. 多發性骨髓瘤（multiple myeloma）
D. 脊椎骨肉瘤（vertebral osteosarcoma）

正確答案：C. 多發性骨髓瘤（multiple myeloma）